Clinical trial exclusion criterion:
Current Moderate or Severe Substance Use Disorder, other than Alcohol, Nicotine or Caffeine Use Disorders

Annotated entities:
- Condition: "Substance Use Disorder"
- Qualifier: "Moderate"
- Qualifier: "Severe"
- Temporal: "Current"
- Negation: "other than"
- Condition: "Alcohol Use Disorders"
- Condition: "Nicotine Use Disorders"
- Condition: "Caffeine Use Disorders"